9. Signed written informed consent

The above is a clinical trial inclusion criterion. Annotated with entity spans:
[Parsing_Error: 9.] [Post-eligibility: Signed written informed consent]